Clinical trial exclusion criterion:
Sustained or symptomatic ventricular dysrhythmias uncontrolled by drug therapy or the use of an implantable defibrillator, and/or significant cardiac conduction defects, e.g., 2nd degree or 3rd degree AV block, or sick sinus syndrome, unless a functioning pacemaker is in place

Entity relations:
- multi("drug therapy", "drug")
- multi("uncontrolled by drug therapy", "drug therapy")
- Has_qualifier("ventricular dysrhythmias", "Sustained")
- multi("uncontrolled by the use of an implantable defibrillator", "implantable defibrillator")
- Has_qualifier("ventricular dysrhythmias", "uncontrolled by drug therapy")
- Has_qualifier("cardiac conduction defects", "significant")
- Has_qualifier("pacemaker", "functioning")
- Has_negation("pacemaker", "unless")
- AND("2nd degree AV block", "pacemaker")
- AND("cardiac conduction defects", "2nd degree AV block")
- OR("Sustained", "symptomatic")
- OR("uncontrolled by drug therapy", "uncontrolled by the use of an implantable defibrillator")
- OR("2nd degree AV block", "sick sinus syndrome", "3rd degree AV block")
- OR("ventricular dysrhythmias", "cardiac conduction defects")